What datasets are available related to Duchenne Muscular Dystrophy?

Using data from the Muscular Dystrophy Surveillance, Tracking, and Research Network (MD STARnet)Five sources of RWD/NHD were contributed by Universitaire Ziekenhuizen Leuven, DMD Italian Group, The Cooperative International Neuromuscular Research Group, ImagingDMD, and the PRO-DMD-01 study (n = 430 patients, in total).